關於艱難梭狀芽胞桿菌（Clostridium difficile）的敘述，下列何者正確？
A. 疾病經常是因長期使用抗生素，造成腸道菌群改變所引起
B. 可用安比西林（ampicillin）和克林黴素（clindamycin）治療
C. 會產生腸毒素（enterotoxin），造成肌肉痙攣
D. 會產生α毒素（α toxin），造成嚴重的軟組織壞死

正確答案：A. 疾病經常是因長期使用抗生素，造成腸道菌群改變所引起